Clinical trial inclusion criterion:
Metastatic ovarian cancer (OV)

Annotated entities:
- Condition: "Metastatic ovarian cancer"